Clinical trial exclusion criterion:
History of sickle cell trait or disease or any other acquired or hereditary hematological abnormality

Annotated entities:
- Condition: "sickle cell trait"
- Condition: "sickle cell disease"
- Condition: "hereditary hematological abnormality"
- Condition: "acquired hematological abnormality"